Clinical trial exclusion criterion:
History of adverse reaction to a-2 adrenergic agonists

Entity relations:
- AND("adverse reaction", "a-2 adrenergic agonists")